以藥物治療妥瑞氏疾患（Tourette's disorder）時，下列何者不被考慮採用？
A. Haloperidol
B. Pimozide
C. Desmopressin
D. Clonidine

正確答案：C. Desmopressin